History of drug or alcohol abuse within recent 1 year

The above is a clinical trial exclusion criterion. Annotated with entity spans:
[Temporal: History] of [Condition: drug] or [Condition: alcohol abuse] [Temporal: within recent 1 year]